En la microangiopatía trombótica familiar por alteración de la vía alterna del complemento, esperaríamos encontrar todas las siguientes características, EXCEPTO:
1. Trombocitosis.
2. Insuficiencia renal con microtrombos en capilares glomerulares en la biopsia renal.
3. Hipertensión arterial.
4. Hematuria y proteinuria no nefróticas.

Respuesta correcta: 1. Trombocitosis.